Para diagnosticar una situación de parada cardiorrespiratoria, la secuencia correcta de valoración según las recomendaciones de la Guía 2010 del Consejo Español de Resucitación Cardiopulmonar consiste en:
1. Comprobar inconsciencia, comprobar signos de vida o presencia de pulso, comprobar si respira y abrir la vía aérea.
2. Comprobar inconsciencia, alertar, abrir la vía aérea y comprobar si respira.
3. Comprobar pulso, alertar, abrir la vía aérea, comprobar inconsciencia, comprobar si respira.
4. Abrir la vía aérea, comprobar inconsciencia, comprobar presencia de pulso o signos de vida (tos, movimiento) y comprobar si respira.
5. Abrir la vía aérea, alertar, comprobar si respira, comprobar presencia de pulso o signos de vida y comprobar inconsciencia.

Respuesta correcta: 2. Comprobar inconsciencia, alertar, abrir la vía aérea y comprobar si respira.